Clinical trial exclusion criterion:
Active self harm urges

Entity relations:
- OR("Active", "self harm urges")